一個 75 歲的男性病患因腹部主動脈瘤接受手術治療，植入 Gortex graft。病人在過去並無腸胃方面的症狀，術後 40 小時，病人在加護病房中，突然出現多次大量的褐色腹瀉，病人仍依靠氣管內管（endotracheal tube）及人工呼吸器呼吸，意識不甚清醒且無法說話，身體檢查並無腹部壓痛，或反彈性壓痛，體溫 37℃，白血球數為 10,000/µL。此時最可能的診斷是什麼？
A. antibiotic-associated colitis
B. aorto-colic fistula
C. ischemic colitis
D. ulcerative colitis

正確答案：C. ischemic colitis